一位中年婦女主訴兩天前眩暈發作，持續半小時至一小時，伴隨左側聽力障礙、耳鳴、耳內腫脹壓迫感。她無高血壓、冠心症、高血脂症或糖尿病等病史。這是兩年來第 3 次發作，每次發作的過程都一樣。下列何者為最可能之診斷？
A. 梅尼爾氏症（Meniere's disease）
B. 良性陣發性位置性眩暈（benign paroxysmal positional vertigo）
C. 前庭神經炎（vestibular neuritis）
D. 椎骨基底動脈循環不全症（vertebro-basilar artery insufficiency）

正確答案：A. 梅尼爾氏症（Meniere's disease）